Clinical trial exclusion criterion:
Has any systemic inflammatory condition, including psoriatic arthritis, active Lyme disease, systemic lupus erythematosus, infectious arthritis, vasculitis, parvovirus infection, rheumatoid arthritis, active uveitis, or active IBD

Annotated entities:
- Condition: "inflammatory condition"
- Condition: "psoriatic arthritis"
- Condition: "Lyme disease"
- Qualifier: "active"
- Condition: "systemic lupus erythematosus"
- Condition: "infectious arthritis"
- Condition: "vasculitis"
- Condition: "parvovirus infection"
- Condition: "rheumatoid arthritis"
- Condition: "active uveitis"
- Condition: "active IBD"